Clinical trial inclusion criterion:
No major fetal malformations

Annotated entities:
- Condition: "major fetal malformations"
- Negation: "No"